Clinical trial exclusion criterion:
Respiratory exacerbation within the 2 months preceding the study

Entity relations:
- Has_index("within the 2 months preceding the study", "the study")